異位性皮膚炎患者其皮膚經常會受到微生物感染，下列那一種病原菌最常見？
A. 金黃色葡萄球菌（Staphylococcus aureus）
B. A 群鏈球菌（group A streptococcus）
C. 黴菌類（fungi）
D. 大腸桿菌（Escherichia coli）

正確答案：A. 金黃色葡萄球菌（Staphylococcus aureus）